ASA> 3;

The above is a clinical trial exclusion criterion. Annotated with entity spans:
[Measurement: ASA][Value: > 3];